李姓學童日前於居家附近池塘游泳返家後，陸續出現發燒、頭痛、鼻塞及嗅覺失常等症狀，經住院檢查發現 白血球高達24,000/cmm（>90%為嗜中性白血球）、頸部僵硬及凱尼格氏徵象（Kernig's sign），並於住院五天後死亡。依據上述結果，李姓學童最可能感染何種寄生蟲？
A. 福氏內格里阿米巴（Naegleria fowleri）
B. 痢疾阿米巴（Entamoeba histolytica）
C. 棘阿米巴（Acanthamoeba spp.）
D. 大腸阿米巴（Entamoeba coli）

正確答案：A. 福氏內格里阿米巴（Naegleria fowleri）